Clinical trial inclusion criterion:
Gestational age = 37 weeks,

Annotated entities:
- Measurement: "Gestational age"
- Value: "= 37 weeks"